下列有關自體耐受性（self tolerance）的觀念何者錯誤？
A. 胸腺與骨髓是維持自我耐受性的重要器官
B. T淋巴細胞自胸腺成熟後，仍有調控機制在維持其周邊耐受性
C. 自胸腺分化來的調節性T細胞（regulatory T cell），可以抑制自體反應性T細胞的活性
D. 調節性T細胞（regulatory T cell）可有效清除腫瘤細胞

正確答案：D. 調節性T細胞（regulatory T cell）可有效清除腫瘤細胞